Allergic to sirolimus or serious side effects

The above is a clinical trial exclusion criterion. Annotated with entity spans:
[Condition: Allergic] to [Drug: sirolimus] or [Qualifier: serious] [Condition: side effects]